Clinical trial exclusion criterion:
Second or third degree heart block without a pacemaker

Entity relations:
- Has_negation("pacemaker", "without")
- AND("Second degree heart block", "pacemaker")
- OR("Second degree heart block", "third degree heart block")